Sobre el enlace entre la base nitrogenada y la ribosa de los nucleótidos:
1. El carbono anomérico de la ribosa se encuentra en configuración alfa.
2. Es un enlace N-glucosídico.
3. Implica al C5´ de la ribosa.
4. En él participan grupos fosfato.
5. Es de distinta naturaleza para cada base nitrogenada.

Respuesta correcta: 2. Es un enlace N-glucosídico.